Cardiovascular or pulmonary disease

The above is a clinical trial exclusion criterion. Annotated with entity spans:
[Condition: Cardiovascular] or [Condition: pulmonary disease]